Clinical trial exclusion criterion:
In-ability to postpone anti-coagulation medications.

Annotated entities:
- Drug: "anti-coagulation medications"
- Mood: "In-ability to postpone"